AJCC Stage III or greater

The above is a clinical trial exclusion criterion. Annotated with entity spans:
[Measurement: AJCC] [Value: Stage III or greater]